List versions of ExpansionHunter

ExpansionHunter Denovo is an efficient catalog-free method for genome-wide repeat expansion detection.  ExpansionHunter is a sequence-graph-based tool to analyze variation in short tandem repeat regions.